Clinical trial inclusion criterion:
Male and female patients between the ages of 18-65 years, inclusive

Annotated entities:
- Person: "Male"
- Person: "female"
- Person: "ages"
- Value: "18-65 years"